A spasticity : a Tardieu score upper or equal to 2 on at least one of the following muscle-triceps surae, flexors of fingers, of wrist and of elbow

The above is a clinical trial inclusion criterion. Annotated with entity spans:
A [Condition: spasticity] : a [Measurement: Tardieu score] [Value: upper or equal to 2] on [Multiplier: at least one] of the following [Qualifier: muscle-triceps surae], [Qualifier: flexors of fingers], of [Qualifier: wrist] and of [Qualifier: elbow]